Clinical trial exclusion criterion:
Participants with a blood pressure in the 95th percentile or greater for age, sex, and height on 2 separate readings recorded on 2 separate days. Those participants who had uncontrolled hypertension at Screening can be rescreened more than 1 month after initiation or adjustment of antihypertensive therapy 1 time.

Entity relations:
- Has_value("blood pressure", "95th percentile or greater")
- Has_qualifier("blood pressure", "for age")
- Has_qualifier("blood pressure", "for height")
- Has_qualifier("blood pressure", "for sex")
- Has_multiplier("blood pressure", "2 separate readings")
- Has_qualifier("2 separate readings", "2 separate days")